Clinical trial inclusion criteria:
Healthy, women ages 18 to 39yo with BMI <30
Regular menstrual cycles with duration between 24-35 days
Completion of screening visit where ovulation will be assessed with blood draw for progesterone level (must be 5ng/mL or greater)
Not seeking pregnancy during the study period
Use of a non-hormonal form of contraception, such as: sterilization (tubal ligation, Essure), copper IUD (intrauterine device), barrier methods or abstinence
Must speak English or Spanish

Annotated entities:
- Condition: "Healthy"
- Person: "women"
- Person: "ages"
- Value: "18 to 39yo"
- Measurement: "BMI"
- Value: "<30"
- Condition: "Regular menstrual cycles"
- Value: "between 24-35 days"
- Measurement: "duration"
- Measurement: "progesterone level"
- Value: "5ng/mL or greater"
- Pregnancy_considerations: "Not seeking pregnancy during the study period"
- Procedure: "non-hormonal form of contraception"
- Procedure: "sterilization"
- Procedure: "tubal ligation"
- Procedure: "Essure"
- Procedure: "copper IUD"
- Procedure: "intrauterine device"
- Procedure: "barrier methods"
- Observation: "abstinence"
- Non-query-able: "Must speak English or Spanish"